Clinical trial exclusion criterion:
Parkinson's or other neurological disease

Annotated entities:
- Condition: "Parkinson's"
- Condition: "neurological disease"